Clinical trial exclusion criterion:
nursing

Annotated entities:
- Condition: "nursing"